Clinical trial inclusion criterion:
IFG: 5.6mmol/L (100mg/dl)=FPG<7.0mmol/L (126mg/dl), or IGT: 7.8mmol/L (140mg/dl)=OGTT 2-h PG<11.1mmol/L (200mg/dl), or HbA1C 5.7-6.4% (39-47mmol/mol);

Annotated entities:
- Condition: "IFG"
- Value: "5.6mmol/L"
- Measurement: "FPG"
- Value: "100mg/dl"
- Value: "<7.0mmol/L"
- Value: "126mg/dl"
- Condition: "IGT"
- Value: "7.8mmol/L"
- Value: "140mg/dl"
- Measurement: "OGTT 2-h PG"
- Measurement: "HbA1C"
- Value: "5.7-6.4%"
- Value: "39-47mmol/mol"
- Value: "<11.1mmol/L"
- Value: "200mg/dl"